Clinical trial exclusion criterion:
Any contraindication to neuraxial anesthesia (history of neurologic disease (e.g., multiple sclerosis, spinal stenosis, central or peripheral neuropathy)

Annotated entities:
- Condition: "contraindication"
- Drug: "neuraxial anesthesia"
- Temporal: "history"
- Condition: "neurologic disease"
- Condition: "multiple sclerosis"
- Condition: "spinal stenosis"
- Condition: "central neuropathy"
- Condition: "peripheral neuropathy"